Where, in the body, would the Cobb-Stainsby excision arthroplasty be performed?

The Cobb-Stainsby forefoot arthroplasty combines partial phalangectomy (Stainsby) with extensor tendon transfer to the metatarsal head (Cobb)